Clinical trial exclusion criteria:
Suspected or confirmed active TB disease
Known allergies to any of the study medications by participant self-report
have a positive pregnancy test at screening, or
are not willing to use a reliable method of barrier contraception during the study, or
are breastfeeding
hormonal contraception
HIV infected participants who are on anti-retroviral drugs
other drugs that interact with 3HP (see Table 1)
Known contact with an INH or rifampin resistant case
Weight < 10 kg
Evidence of possible liver damage defined by an aspartate transaminase (AST) level that is more than 3x the upper limit of normal in an asymptomatic patient
Porphyria reported by patient
Inability to adhere to protocol.
Patients may be excluded from the study for other reasons, at the investigator's discretion with detailed documentation.

Annotated entities:
- Condition: "active TB"
- Condition: "allergies"
- Non-query-able: "Known allergies to any of the study medications by participant self-report"
- Pregnancy_considerations: "have a positive pregnancy test at screening"
- Pregnancy_considerations: "are not willing to use a reliable method of barrier contraception during the study"
- Pregnancy_considerations: "are breastfeeding"
- Procedure: "hormonal contraception"
- Condition: "HIV infected"
- Drug: "anti-retroviral drugs"
- Non-query-able: "other drugs that interact with 3HP (see Table 1)"
- Condition: "resistant"
- Drug: "rifampin"
- Drug: "INH"
- Measurement: "Weight"
- Value: "< 10 kg"
- Condition: "liver damage"
- Measurement: "aspartate transaminase"
- Measurement: "AST"
- Value: "more than 3x the upper limit of normal"
- Condition: "Porphyria"
- Post-eligibility: "Inability to adhere to protocol"
- Non-query-able: "Patients may be excluded from the study for other reasons, at the investigator's discretion with detailed documentatio"